產生 Graft-versus-host disease（GVHD）的原因為何？
A. 移植的 pancreas 釋出消化酵素引起組織損傷
B. 移植的 liver 發生炎性反應引起內皮損傷
C. 移植的 kidney 釋出廢物毒素引起內皮損傷
D. 移植的bone marrow中成熟的T細胞攻擊宿主

正確答案：D. 移植的bone marrow中成熟的T細胞攻擊宿主